Clinical trial exclusion criteria:
Patients with any contraindications or hypersensitivity related to antiplatelet therapy
Patients with Acute Myocardial Infarction (ST elevation myocardial infarction, Non ST elevation myocardial infarction)
Patients who are anticipated to receive treatment or surgery that may require desisting the administration of antiplatelet therapy for 2 weeks or longer during the period of the clinical trial
Chronic total occlusion (CTO) lesions, in-stent restenosis (ISR)
Patients experiencing cardiogenic shock
Women who are breastfeeding, pregnant, or desiring pregnancy
Patients with findings of hemorrhage
Patients with a life expectancy of less than 1 year
Patients who have received a drug-eluting stent (DES) procedure within the past 6 months
Any other patients judged by the investigator to be unsuitable for the trial

Annotated entities:
- Condition: "contraindications"
- Condition: "hypersensitivity"
- Procedure: "antiplatelet therapy"
- Condition: "Acute Myocardial Infarction"
- Condition: "ST elevation myocardial infarction"
- Condition: "Non ST elevation myocardial infarction"
- Mood: "anticipated to"
- Procedure: "treatment"
- Procedure: "surgery"
- Procedure: "antiplatelet therapy"
- Temporal: "for 2 weeks or longer"
- Condition: "Chronic total occlusion"
- Condition: "CTO"
- Condition: "in-stent restenosis"
- Condition: "ISR"
- Condition: "cardiogenic shock"
- Pregnancy_considerations: "Women who are breastfeeding, pregnant, or desiring pregnancy"
- Condition: "hemorrhage"
- Observation: "life expectancy"
- Value: "less than 1 year"
- Procedure: "drug-eluting stent procedure"
- Procedure: "DES"
- Temporal: "past 6 months"
- Non-query-able: "Any other patients judged by the investigator to be unsuitable for the trial"